Clinical trial exclusion criterion:
Known neurological disorders or documented serious head injury.

Entity relations:
- Has_qualifier("head injury", "serious")
- OR("neurological disorders", "head injury")